關於食道弛緩不能（achalasia），下列敘述何者錯誤？
A. 特徵為缺乏食道蠕動，下食道括約肌無法完全放鬆，進而增加下食道括約肌的壓力
B. 臨床表現有嘔吐、吞嚥困難、體重減輕、胸痛、逆流及咳嗽等
C. 食道壓力檢測（manometry）可協助診斷
D. 以內視鏡注射肉毒桿菌毒素（botulinum toxin）可完全治癒

正確答案：D. 以內視鏡注射肉毒桿菌毒素（botulinum toxin）可完全治癒